Current glucose lowering therapy either mono, dual or triple of any combination of metformin, sulphonylurea, DPP-IV inhibitor, GLP-1 therapy or an SGLT2 +/- diet and exercise

The above is a clinical trial inclusion criterion. Annotated with entity spans:
Current [Procedure: glucose lowering therapy] either mono, dual or triple of any combination of [Drug: metformin], [Drug: sulphonylurea], [Drug: DPP-IV inhibitor,] [Drug: GLP-1 therapy] or an [Drug: SGLT2] +/- [Observation: diet] and [Observation: exercise]